Clinical trial exclusion criterion:
BMI above 30.

Entity relations:
- Has_value("BMI", "above 30")